Clinical trial exclusion criterion:
Previous treated with anti-diabetic medication

Entity relations:
- AND("treated", "anti-diabetic medication")
- Has_temporal("treated", "Previous")